Clinical trial exclusion criterion:
Significant (as defined by the PI) intolerance of presently-used DMT

Annotated entities:
- Qualifier: "Significant"
- Condition: "intolerance"
- Temporal: "presently-used"
- Drug: "DMT"